baby K 在產檢時就被診斷出罹患無腦症。這種疾病目前仍無法醫治，通常至多能存活一個禮拜。儘管情況如此，baby K 的母親還是決定生下 baby K。當 baby K 一出生，立刻就插管治療並接上呼吸輔助器。主治醫師認為繼續治療並無益處，因此建議拔除呼吸器，但 baby K 的母親反對。下列何者不是正確的倫理考量？
A. 繼續以插管治療對 baby K 而言是殘忍而不必要的，並且違反不傷害原則
B. 繼續積極治療 baby K 可能不會帶來任何醫療效益，並且違反行善原則
C. baby K 在新生兒加護病房的每日花費大約是 2 萬元，全數由全民健保支付，繼續無益治療將違反正義原則
D. 拒絕治療 baby K 將構成了對先天嚴重缺陷兒的歧視，並且違反尊重自主原則

正確答案：D. 拒絕治療 baby K 將構成了對先天嚴重缺陷兒的歧視，並且違反尊重自主原則